Clinical trial exclusion criterion:
Consumption or injection of insulin

Annotated entities:
- Drug: "insulin"
- Procedure: "injection"
- Drug: "insulin"